以下會導致兒童產生寡尿（oliguria）的四種情況中，其典型尿液指標，尿鈉及尿滲透壓（osmolality），何者與其他三者明顯不同？
A. 急性鏈球菌感染後腎絲球腎炎合併腎衰竭
B. 急性腎小管細胞壞死合併腎衰竭
C. 肝腎症候群（hepatorenal syndrome）合併腎衰竭
D. 心臟衰竭

正確答案：B. 急性腎小管細胞壞死合併腎衰竭